Use of drugs that might have enhanced or inhibited CYP3A4 or P-gp activity

The above is a clinical trial exclusion criterion. Annotated with entity spans:
[Non-query-able: Use of drugs that might have enhanced or inhibited CYP3A4 or P-gp activity]